Clinical trial exclusion criterion:
Has been diagnosed with cancer and who will be undergoing chemotherapy or radiation therapy during the vaccination healing time.

Annotated entities:
- Condition: "diagnosed with cancer"
- Procedure: "chemotherapy"
- Procedure: "radiation therapy"
- Temporal: "during the vaccination healing time"
- Reference_point: "vaccination healing time"